List the vaccine strains contained in Fluvirin.

Fluvirin contains 18 mg of haemagglutinin per H1N1 vaccine strain, 17 mg of haemagglutinin per H3N2 vaccine strain, and 15 mg of haemagglutinin per B vaccine strain.